Clinical trial exclusion criterion:
History of multiple myeloma

Entity relations:
- Has_temporal("multiple myeloma", "History")